¿Cuál de las siguientes moléculas presenta enlace covalente sencillo?
1. C2.
2. N 2.
3. O 2.
4. O 3.
5. F 2.

Respuesta correcta: 5. F 2.